肛直腸彎曲（anorectal flexure）之角度，主要由下列何者所牽引形成？
A. 恥直腸肌（puborectalis muscle）
B. 恥尾肌（pubococcygeal  muscle）
C. 會陰深橫肌（deep transverse perineal  muscle）
D. 肛門外括約肌（external anal sphincter）

正確答案：A. 恥直腸肌（puborectalis muscle）